Clinical trial exclusion criterion:
1. Uncorrected congenital systemic-to-pulmonary shunt.

Annotated entities:
- Parsing_Error: "1."
- Condition: "congenital systemic-to-pulmonary shunt"
- Qualifier: "Uncorrected"